李先生，75歲，有多次腦中風及高血壓、糖尿病病史，神經學檢查時，無明顯肌肉乏力，但呈現口齒不清、吞嚥障礙，情緒失禁（emotional incontinence）及兩側深部肌腱反射增強 （hyperreflexia），下列何者最正確？
A. 可能是假性延髓性麻痺（pseudobulbar palsy）
B. 可能是糖尿病神經病變，與腦中風無關
C. 可能是急性左側大腦半球梗塞（left hemisphere infarction），與過去腦中風病史無關
D. 除腦中風外，無其他疾病會引起此症狀

正確答案：A. 可能是假性延髓性麻痺（pseudobulbar palsy）